下列有關急性散漫性腦脊髓炎（acute disseminated encephalomyelitis, ADEM）之敘述，何者錯誤？
A. 是一種去髓脫病變（demyelinating illness）
B. 是一種急性發炎反應（acute inflammatory illness）
C. 可產生腦膜浸潤（meningeal infiltration）
D. 常侵犯神經細胞（neuron）

正確答案：D. 常侵犯神經細胞（neuron）